Clinical trial inclusion criteria:
acute myocardial infarction or
ischemic cardiomyopathy with or without previous myocardial infarction or
dilated cardiomyopathy due to valvular heart disease, hypertensive heart disease, history of myocarditis (no active myocardial infection present)

Annotated entities:
- Condition: "acute myocardial infarction"
- Condition: "ischemic cardiomyopathy"
- Condition: "myocardial infarction"
- Temporal: "previous"
- Condition: "dilated cardiomyopathy"
- Condition: "valvular heart disease"
- Condition: "hypertensive heart disease"
- Condition: "myocarditis"
- Temporal: "history"
- Condition: "myocardial infection"
- Negation: "no"
- Temporal: "active"